Clinical trial exclusion criterion:
Participants who have been treated with testosterone in the past 6 months and for whom testosterone therapy is contraindicated

Entity relations:
- Has_temporal("testosterone", "in the past 6 months")
- AND("contraindicated", "testosterone therapy")
- multi("testosterone therapy", "testosterone")